4. Active opportunistic infection or active neurological disease that might confound evaluation.

The above is a clinical trial exclusion criterion. Annotated with entity spans:
4. [Temporal: Active] [Condition: opportunistic infection] or [Temporal: active] [Condition: neurological disease] that might confound evaluation.